Clinical trial inclusion criterion:
Birthweight >2500g

Entity relations:
- Has_value("Birthweight", ">2500g")